Clinical trial inclusion criterion:
Children 6 month to 14 years who will be presented to the pediatric emergency or attended by emergency medical service who have active seizure and had no intravenous access would be eligible for the study.

Entity relations:
- Has_value("years", "6 month to 14 years")
- Has_qualifier("seizure", "active")
- Has_negation("intravenous access", "no")
- OR("pediatric emergency", "attended by emergency medical service")